Clinical trial exclusion criterion:
Previous large bowel/rectal surgery

Annotated entities:
- Procedure: "rectal surgery"
- Procedure: "large bowel surgery"
- Parsing_Error: "/"